一位 56 歲女性，最近幾個月來腹圍逐漸變大。身體診查發現兩側卵巢有囊狀腫瘤及腹水存在。細胞學檢查發現腹水中有惡性細胞。她接受腫瘤切除手術，標本的腫瘤囊壁表面可見許多乳突樣突起。 下列有關此病變的敘述，何者最正確？
A. 血中 β-human chorionic gonadotropin 濃度增加
B. 很可能出現腹腔偽黏液瘤（pseudomyxoma peritonei）
C. 卵巢腫瘤最可能是顆粒細胞瘤（granulosa cell tumor）
D. 顯微鏡下觀察卵巢腫瘤，常可見砂礫小體（psammoma bodies）

正確答案：D. 顯微鏡下觀察卵巢腫瘤，常可見砂礫小體（psammoma bodies）